Clinical trial exclusion criterion:
12. Active peptic ulcer or upper gastrointestinal bleeding within the prior 3 months.

Annotated entities:
- Condition: "peptic ulcer"
- Temporal: "Active"
- Condition: "upper gastrointestinal bleeding"
- Temporal: "within the prior 3 months"